Patient is mentally incapacitated and cannot consent or comply with follow-up.

The above is a clinical trial exclusion criterion. Annotated with entity spans:
[Post-eligibility: Patient is mentally incapacitated and cannot consent or comply with follow-up].